chest deformity;

The above is a clinical trial exclusion criterion. Annotated with entity spans:
[Condition: chest deformity];